Clinical trial inclusion criterion:
4. Agreement not to attempt to become pregnant

Annotated entities:
- Parsing_Error: "4."
- Non-query-able: "Agreement not to attempt to become pregnant"
- Post-eligibility: "Agreement not to attempt to become pregnant"